patients with gastrointestinal conditions preventing adsorption of oral medication.

The above is a clinical trial exclusion criterion. Annotated with entity spans:
[Non-query-able: patients with gastrointestinal conditions preventing adsorption of oral medication.]